Clinical trial inclusion criterion:
Can speak and write fluent conversational English

Annotated entities:
- Non-query-able: "Can speak and write fluent conversational English"